Coagulopathy or bleeding tendency caused by organ dysfunction, such as cirrhosis, bone marrow suppression etc.

The above is a clinical trial exclusion criterion. Annotated with entity spans:
[Condition: Coagulopathy] or [Condition: bleeding tendency] caused by [Condition: organ dysfunction], such as [Condition: cirrhosis], [Condition: bone marrow suppression] etc.